Woman signing the consent form for at least the blood sample

The above is a clinical trial inclusion criterion. Annotated with entity spans:
[Post-eligibility: Woman signing the consent form for at least the blood sample]